El antígeno O que se utiliza en la clasificación de las bacterias Gram negativas se corresponde con:
1. Las proteínas flagelares.
2. Componentes de la cápsula.
3. El peptidoglicano.
4. El polisacárido de los lipopolisacáridos.
5. Proteínas de la membrana plásmica.

Respuesta correcta: 4. El polisacárido de los lipopolisacáridos.